Subject with a history of congenital QT prolongation

The above is a clinical trial exclusion criterion. Annotated with entity spans:
Subject with a [Temporal: history of] [Condition: congenital QT prolongation]